Clinical trial exclusion criterion:
exposure to altitudes >1500m for >2 days within the last 4 weeks before the study.

Annotated entities:
- Non-query-able: "exposure to altitudes >1500m for >2 days within the last 4 weeks before the study."